Is Huntington's disease caused by a dominate or recessive gene?

Huntington's disease is caused by an autosomal dominant gene.